Contraindication to administration of Gadolinium (Gd) based contrast agents (GBCA):

The above is a clinical trial exclusion criterion. Annotated with entity spans:
[Condition: Contraindication] to administration of [Drug: Gadolinium (Gd) based contrast agents (GBCA)]: